La capacidad residual funcional es el volumen:
1. Residual más el de reserva espiratorio.
2. Pulmonar tras una espiración forzada.
3. Residual.
4. Máximo que puede ser inspirado.
5. Corriente más el de reserva espiratorio.

Respuesta correcta: 1. Residual más el de reserva espiratorio.